En el control de enfermedades crónicas que requieren de un tratamiento continuo, uno de los principales retos para la enfermera de atención primaria, es el favorecer la adhesión al tratamiento farmacológico y dar recomendaciones relacionadas con los estilos de vida. De las siguientes recomendaciones, ¿cuál NO estaría indicada para fomentar dicha adhesión?:
1. Proporcionar consejos claros sobre los beneficios y posibles efectos adversos del tratamiento y sobre la posología y la duración del mismo.
2. Tener en cuenta los hábitos y preferencias del paciente.
3. Utilizar dietas y tablas de ejercicios estandarizadas que disminuyan la monitorización.
4. Establecer una relación terapéutica basada en la entrevista motivacional.
5. Ofrecer sesiones múltiples o combinadas de intervenciones conductuales.

Respuesta correcta: 3. Utilizar dietas y tablas de ejercicios estandarizadas que disminuyan la monitorización.